La dieta sin gluten es el pilar fundamental en el tratamiento de la enfermedad celíaca. Al respecto, son numerosos los productos manufacturados con una composición incierta en cuanto al gluten, siendo frecuente encontrar etiquetados engañosos. De los siguientes grupos de alimentos ¿Cuál podemos considerar completamente seguro en la dieta de un paciente celíaco?
1. Conservas      de     carne:   Hamburguesas, albóndigas.
2. Leche y derivados: yogur, queso, nata, cuajada.
3. Salsas, condimentos y aditivos alimentarios.
4. Pasta integral: fideos, macarrones, tallarines.
5. Productos de charcutería, embutidos, patés.

Respuesta correcta: 2. Leche y derivados: yogur, queso, nata, cuajada.